腫瘤細胞有多種方式逃避免疫系統的偵查及消滅，而得以繼續長大，但不包括下列那一項？
A. 不表現黏	分子（adhesion molecules）及共同刺激分子（co-stimulatory molecules）
B. 升高抗IgG抗體（anti-IgG antibody）之風濕因子（rheumatoid factor）以自我保護
C. 分泌出抑制T細胞作用的因子
D. 分泌出物質包裹自己，形成免疫優勢場所（tumor-induced privileged site）

正確答案：B. 升高抗IgG抗體（anti-IgG antibody）之風濕因子（rheumatoid factor）以自我保護